Clinical trial exclusion criterion:
previous retinal vein occlusion.

Annotated entities:
- Condition: "retinal vein occlusion"
- Temporal: "previous"